Which is the target of belimumab in Systemic Lupus Erythematosus treatment?

blys